Clinical trial inclusion criterion:
Partial thromboplastin time (PTT) must be </= 1.5 x upper normal limit of institution's normal range and INR (International Normalized Ratio) < 1.5.

Annotated entities:
- Measurement: "Partial thromboplastin time (PTT)"
- Value: "</= 1.5 x upper normal limit"
- Measurement: "INR (International Normalized Ratio)"
- Value: "< 1.5"